Clinical trial exclusion criterion:
Contraindications and/or known hypersensitivity to the active substance and/or any of the excipients of epoetin beta treatment

Entity relations:
- AND("Contraindications", "epoetin beta treatment")
- OR("Contraindications", "hypersensitivity")